Clinical trial exclusion criterion:
Renal diseases;

Annotated entities:
- Condition: "Renal diseases"